Clinical trial exclusion criterion:
Use of antidiabetic drugs other than metformin within 3 months prior to screening.

Entity relations:
- Has_negation("metformin", "other than")
- AND("antidiabetic drugs", "metformin")
- Has_temporal("antidiabetic drugs", "within 3 months prior to screening")